17 歲女性，出現肝功能異常、腹水、脾臟腫大及手顫抖等現象，病人亦偶有精神症狀和行為異常。 肝臟穿刺切片最可能出現下列何種變化？
A. 銅離子沉積在肝細胞
B. periodic acid-Schiff（PAS）染色陽性的小球（globule）
C. 脂肪性肝炎（steatohepatitis）
D. 非化膿性肝內膽管破壞（nonsuppurative destruction of intrahepatic bile duct）

正確答案：A. 銅離子沉積在肝細胞